Clinical trial inclusion criterion:
Adult men and women> 18 years old

Annotated entities:
- Person: "Adult"
- Person: "men"
- Person: "women"
- Value: "> 18 years old"
- Person: "old"